Clinical trial exclusion criterion:
Infants who have already received postnatal vitamin D supplementation

Annotated entities:
- Person: "Infants"
- Procedure: "postnatal vitamin D supplementation"
- Drug: "vitamin D"